Clinically significant abnormal 12-lead ECG findings;

The above is a clinical trial exclusion criterion. Annotated with entity spans:
[Qualifier: Clinically significant] [Qualifier: abnormal] [Procedure: 12-lead ECG] [Condition: findings];